有關抗穆勒氏賀爾蒙（antimüllerian hormone, AMH）敘述，下列何者錯誤？
A. 用來評估婦女卵子庫存量和卵巢刺激反應的檢測工具之一
B. 是由較小的卵泡例如竇前卵泡或竇卵泡（preantral and small antral follicles）所分泌
C. AMH的值不受到性腺激素的影響（gonadotropin-independent）
D. AMH值無法用來預測卵巢對於FSH刺激的反應

正確答案：D. AMH值無法用來預測卵巢對於FSH刺激的反應